Clinical trial exclusion criteria:
allergic to dexmedetomidine, similar active ingredients or excipients
G-6-PD deficiency
a history of arrhythmia, bronchial and cardiovascular diseases, abnormal liver function and so on
a history of use of alpha 2 receptor agonists or antagonists.

Annotated entities:
- Drug: "dexmedetomidine"
- Condition: "allergic"
- Drug: "similar active ingredients"
- Drug: "excipients"
- Condition: "G-6-PD deficiency"
- Condition: "arrhythmia"
- Temporal: "history"
- Condition: "bronchial diseases"
- Condition: "cardiovascular diseases"
- Condition: "abnormal liver function"
- Temporal: "history"
- Drug: "alpha 2 receptor agonists"
- Drug: "alpha 2 receptor antagonists"